Gentamicin與下列何種抗生素合併使用時，最易對腎臟產生加成性（potentiation）的毒性作用？
A. amphotericin B
B. ceftriaxone
C. doxycyclin
D. nafcillin

正確答案：A. amphotericin B